¿Cómo se denomina a la especialidad de la Historia de la Enfermería que se dedica al estudio de los sistemas de cuidados existentes en la Prehistoria?
1. Paleoenfermería.
2. Neoenfermería.
3. Primoenfermería.
4. Etnoenfermería.
5. Mesoenfermería.

Respuesta correcta: 1. Paleoenfermería.